Clinical trial exclusion criterion:
Rectal prolapse

Annotated entities:
- Condition: "Rectal prolapse"